Para R.B. Cattell, los datos T corresponderían a la información recogida a través de:
1. Autoinformes.
2. Escalas de evaluación de terceros.
3. Tests objetivos.
4. Un cuestionario como el 16PF.
5. La técnica de rejilla.

Respuesta correcta: 3. Tests objetivos.